Which mushroom is poisonous, Amanita phalloides or Agaricus Bisporus

The well-known cultivated species Agaricus bisporus is safe to eat while Amanita Phalloides is poisonous.